20 - 100 yrs old

The above is a clinical trial inclusion criterion. Annotated with entity spans:
[Value: 20 - 100 yrs] [Person: old]